Clinical trial exclusion criterion:
patients with Hb values < 11 g/dl and platelet values < 150,000/mmc.

Annotated entities:
- Measurement: "Hb"
- Value: "< 11 g/dl"
- Measurement: "platelet"
- Value: "< 150,000/mmc"